Clinical trial exclusion criterion:
Thrombosis extending into the porta(thrombosis of one of left or right branch authorized), extra hepatic metastasis

Entity relations:
- Has_qualifier("Thrombosis", "extending into the porta")
- Has_qualifier("thrombosis", "left branch")
- Has_negation("thrombosis", "authorized")
- OR("left branch", "right branch")
- OR("Thrombosis", "thrombosis")